Clinical trial exclusion criterion:
Has received sorafenib or oxaliplatin-based chemotherapy within 14 days of first dose of study medication

Annotated entities:
- Drug: "sorafenib"
- Drug: "oxaliplatin"
- Procedure: "chemotherapy"
- Qualifier: "sorafenib or oxaliplatin-based"
- Temporal: "within 14 days"
- Reference_point: "first dose of study medication"